Los temores principales de los paciente adultos ante la enfermedad son:
1. La pérdida de la integridad corporal y el volverse dependientes.
2. La desesperanza en la recuperación y la pérdida de integridad corporal.
3. La repercusión sobre el entorno familiar y la desesperanza en la recuperación.
4. Volverse dependientes y perder el control sobre el proceso de la enfermedad.

Respuesta correcta: 1. La pérdida de la integridad corporal y el volverse dependientes.